Clinical trial inclusion criterion:
3. Have a positive finding on MBI that is < 2 cm in size and requires additional diagnostic workup with focused ultrasound.

Entity relations:
- Has_value("size", "< 2 cm")
- AND("positive finding", "MBI")
- AND("MBI", "size")